Clinical trial inclusion criterion:
life expectancy of more than 3 months

Entity relations:
- Has_value("life expectancy", "more than 3 months")